Clinical trial inclusion criteria:
Patients undergoing surgery on shoulder, humerus, or clavicle

Annotated entities:
- Procedure: "surgery"
- Qualifier: "shoulder"
- Qualifier: "humerus"
- Qualifier: "clavicle"